Clinical trial exclusion criterion:
Concomitant or previous malignancies with the exception of adequately treated basal cell or squamous cell skin cancer, in situ cervical cancer, incidental carcinoid, or other cancer from which the patient has been disease free for 5 years.

Annotated entities:
- Condition: "malignancies"
- Qualifier: "previous"
- Qualifier: "Concomitant"
- Condition: "basal cell skin cancer"
- Condition: "squamous cell skin cancer"
- Condition: "in situ cervical cancer"
- Condition: "incidental carcinoid"
- Condition: "other cancer"
- Negation: "the exception of"
- Qualifier: "adequately treated"
- Temporal: "for 5 years"
- Qualifier: "has been disease free"